李先生 10 歲即因慢性腎衰竭開始透析治療。5 年前接受換腎移植，並且於 3 年前得一女。最近他發現女兒有間歇性的紅尿。在診間醫生發現李先生有輕度的智能障礙。該童初步的尿液試紙檢驗呈現 3＋blood。該童最有可能的診斷是：
A. Alport 症候群（Alport syndrome）
B. 高鈣尿（hypercalciuria）
C. 膜性腎炎（membranous glomerulopathy）
D. Goodpasture 症候群（Goodpasture syndrome）

正確答案：A. Alport 症候群（Alport syndrome）